Clinical trial exclusion criterion:
Estimated GFR <60 mL/min/1.73 m2 using the Cockcroft-Gault formula measurement of the individual parameters following at least 5 minutes of rest at Screening.

Entity relations:
- Has_value("Estimated GFR", "<60 mL/min/1.73 m2")
- Has_context("Estimated GFR", "Cockcroft-Gault formula")